Clinical trial exclusion criterion:
patients with previous surgery of the cervix (conization);

Entity relations:
- Has_qualifier("surgery", "cervix")
- Subsumes("surgery", "conization")